一位 70 歲男性欲接受全膝關節置換術，病患有冠狀動脈病史並接受過心導管氣球擴張術，症狀改善。輕微運動時仍需稍作休息，但無胸悶症狀。手術採全身麻醉，以 thiopental、succinylcholine 及 halothane 來進行麻醉。在放置膝關節時，突然血壓下降，ECG 顯示心房纖維顫動，心率為 105 次/分。下列敘述何者最有可能？
A. 病患可能發生惡性高溫
B. 病患可能發生急性心肌梗塞
C. 可能發生脂肪栓塞，潮氣末二氧化碳（end-tidal carbon dioxide）會增加至 60 mmHg 左右
D. 可能是骨泥中 methylmethacrylate 之產生而造成的

正確答案：D. 可能是骨泥中 methylmethacrylate 之產生而造成的